Use of any immunosuppressive drug at the time of the study or 30 days previously. Topical steroids will not be considered an immunosuppressive drug and their use will not be considered an exclusion criteria.

The above is a clinical trial exclusion criterion. Annotated with entity spans:
Use of any [Drug: immunosuppressive drug] [Temporal: at the time of the study] or [Temporal: 30 days previously]. [Drug: Topical steroids] will [Negation: not] be considered an immunosuppressive drug and their use will not be considered an exclusion criteria.